下列有關前列腺炎（prostatitis）的敘述， 何者較不正確？
A. 急性細菌性前列腺炎（acute bacterial prostatitis），其致病病原菌通常與引起泌尿道感染的病原菌類似
B. 慢性細菌性前列腺炎（chronic bacterial prostatitis）一般不易診斷與治療，病人常有反覆泌尿道感染的病史
C. 在美國，最常引起肉芽腫性前列腺炎（granulomatous prostatitis）的原因是使用Bacillus Calmette-Guérin
D. 慢性非細菌性前列腺炎（chronic abacterial prostatitis）的病人一般沒有反覆泌尿道感染的病史，其發生率是各種前列腺炎中最低的

正確答案：D. 慢性非細菌性前列腺炎（chronic abacterial prostatitis）的病人一般沒有反覆泌尿道感染的病史，其發生率是各種前列腺炎中最低的